最常見的原發氣管內惡性腫瘤為：
A. adenocarcinoma
B. squamous cell carcinoma
C. small cell carcinoma
D. carcinoid tumor

正確答案：B. squamous cell carcinoma